Inability to provide informed consent or to comply with study assessments (e.g. due to cognitive impairment or geographic distance).

The above is a clinical trial exclusion criterion. Annotated with entity spans:
[Post-eligibility: Inability to provide informed consent or to comply with study assessments (e.g. due to cognitive impairment or geographic distance).]